Clinical trial inclusion criterion:
no pathological HINTS (examination criteria in acute vestibular syndrome)

Entity relations:
- Has_qualifier("HINTS", "pathological")
- Has_negation("HINTS", "no")